有關 chronic ulcerative colitis 之敘述，何者為非？
A. 通常不侵犯小腸
B. 很少有肛門方面的病變
C. 直腸不一定會有問題
D. 不會有 skipped area 的情形發生

正確答案：C. 直腸不一定會有問題